下列那個疾病最不會導致結膜纖維化？
A. 稻草熱結膜炎（hay fever conjunctivitis）
B. 史蒂夫-強生症候群（Stevens-Johnson syndrome）
C. 結痂性砂眼（cicatricial trachoma）
D. 類天疱瘡（cicatricial pemphigoid）

正確答案：A. 稻草熱結膜炎（hay fever conjunctivitis）